Cervical cerclage 1st or 2nd trimester of pregnancy undergoing with spinal anesthesia

The above is a clinical trial inclusion criterion. Annotated with entity spans:
[Procedure: Cervical cerclage] [Qualifier: 1st] or [Qualifier: 2nd trimester] of [Condition: pregnancy] undergoing with [Procedure: spinal anesthesia]